Clinical trial exclusion criterion:
Chronic alcohol abuse

Annotated entities:
- Multiplier: "Chronic"
- Condition: "alcohol abuse"